Clinical trial exclusion criterion:
Significant renal disease manifested by creatinine clearance of < 30 ml/min)

Entity relations:
- Has_value("creatinine clearance", "< 30 ml/min")
- Has_qualifier("renal disease", "Significant")
- Subsumes("renal disease", "creatinine clearance")